一位36週早產兒經剖腹產生下後，發生呼吸窘迫症狀，呼吸聲有囉音（rales），經給予氧氣 25%）及連續性氣道正壓（CPAP）呼吸後，症狀逐漸改善，隔天即無症狀。下列那一項是最可能的診斷？
A. 呼吸窘迫症候群（respiratory distress syndrome）
B. 短暫呼吸急促（transient tachypnea of newborn）
C. 細菌性肺炎（bacterial pneumonia）
D. 自發性氣胸（spontaneous pneumothorax）

正確答案：B. 短暫呼吸急促（transient tachypnea of newborn）